Clinical trial exclusion criterion:
Patients with intestinal pathology or severe diarrhea that may decrease absorption according to medical criteria.

Annotated entities:
- Condition: "intestinal pathology"
- Condition: "severe diarrhea"
- Observation: "may decrease absorption"